Clinical trial exclusion criteria:
The other types of pulmonary hypertension.
Subjects who refuse to subscribe written informed consents or can't cooperate with the trial well.
Subjects with serious acute or chronic disease involved liver, kidney, and brain or have to use potent CYP3A4-inhibitor or nitrate to treat the underlying diseases.
Subjects who are currently treated with sildenafil for PAH or taking sildenafil or tadalafil.
Other contraindications in package insert.

Annotated entities:
- Condition: "pulmonary hypertension"
- Qualifier: "other types"
- Observation: "refuse to subscribe written informed consents"
- Observation: "can't cooperate with the trial"
- Condition: "chronic disease involved liver"
- Temporal: "acute"
- Qualifier: "serious"
- Condition: "chronic disease involved kidney"
- Condition: "chronic disease involved brain"
- Drug: "CYP3A4-inhibitor"
- Drug: "nitrate"
- Qualifier: "potent"
- Condition: "underlying diseases"
- Drug: "sildenafil"
- Condition: "PAH"
- Drug: "sildenafil"
- Drug: "tadalafil"
- Temporal: "currently"
- Observation: "contraindications in package insert"